able and willing to give written consent for participation in the study;

The above is a clinical trial inclusion criterion. Annotated with entity spans:
[Non-query-able: able and willing to give written consent for participation in the study;]